Clinical trial exclusion criterion:
Intolerance or allergy to ASA, clopidogrel or ticlopidine precluding treatment for 12 months

Annotated entities:
- Condition: "Intolerance"
- Condition: "allergy"
- Drug: "ASA"
- Drug: "clopidogrel"
- Drug: "ticlopidine"
- Temporal: "for 12 months"
- Negation: "precluding"
- Procedure: "treatment"